How is bladder wall thickness measured?

Ultrasound